Clinical trial inclusion criterion:
Written informed consent obtained from the subject prior to performing any study specific procedure.

Entity relations:
- Has_index("prior to performing any study specific procedure", "performing any study specific procedure")
- multi("performing any study specific procedure", "study specific procedure")
- Has_temporal("Written informed consent", "prior to performing any study specific procedure")